Any intraocular inflammation in the study eye present during the screening slit lamp examination

The above is a clinical trial exclusion criterion. Annotated with entity spans:
Any [Condition: intraocular inflammation] in the study eye present [Temporal: during the screening slit lamp examination]